何種水中污染物會造成幼兒「藍嬰症」（methemoglobenemia）問題？
A. 硫酸鹽
B. 硝酸鹽
C. 磷酸鹽
D. 碳酸鹽

正確答案：B. 硝酸鹽